Presenting an acute endodontic/periodontal lesion in the neighboring areas to the implant site.

The above is a clinical trial exclusion criterion. Annotated with entity spans:
Presenting an acute endodontic/[Condition: periodontal lesion] in the neighboring areas to the implant site.